Clinical trial exclusion criterion:
Any diabetic macular edema treatment in the past 4 months

Entity relations:
- AND("treatment", "diabetic macular edema")
- Has_temporal("treatment", "in the past 4 months")